Clinical trial inclusion criterion:
Serum creatinine, ≤ 1.5x Institutional Upper Limit of Normal (ULN), or Creatinine Clearance ≥ 50 mL/min (by Cockcroft-Gault formula)

Entity relations:
- Has_value("Serum creatinine", "≤ 1.5x Institutional Upper Limit of Normal (ULN)")
- Has_value("Creatinine Clearance", "≥ 50 mL/min")
- Has_qualifier("Creatinine Clearance", "Cockcroft-Gault formula")